Clinical trial inclusion criterion:
Diagnosis of Type 1 diabetes (for at least a year)

Annotated entities:
- Condition: "Type 1 diabetes"
- Temporal: "at least a year"